Clinical trial inclusion criterion:
Ambulatory status (outpatient) at time of consent

Entity relations:
- Subsumes("Ambulatory status", "outpatient")
- Has_temporal("Ambulatory status", "at time of consent")